Clinical trial exclusion criterion:
Subjects who had a serious adverse events during stem cell therapy

Annotated entities:
- Undefined_semantics: "serious adverse events"
- Condition: "serious adverse events"
- Temporal: "during"
- Reference_point: "stem cell therapy"
- Procedure: "stem cell therapy"